No one with missing data that are needed for the differential diagnosis, or for selection of the proper therapy arm

The above is a clinical trial exclusion criterion. Annotated with entity spans:
[Negation: No] one with missing data that are needed for the differential diagnosis, or for selection of the proper therapy arm